Clinical trial exclusion criterion:
Serum potassium < 3.5 mmol/L or >5.5 mmol/L

Annotated entities:
- Measurement: "Serum potassium"
- Value: "< 3.5 mmol/L"
- Value: ">5.5 mmol/L"